Clinical trial inclusion criterion:
English or Spanish speaking*

Entity relations:
- OR("English speaking", "Spanish speaking")